一位 60 歲男性慢性肺氣腫病患，接受胃部次全切除手術 24 小時後，病人的呼吸次數為 20/分，心跳次數為 100/分。此外，病人的動脈血液氣體分析顯示：pH = 7.37、PO2 = 78 torr、PCO2 = 52 torr、BE = +6 meq。 對該病人的處置，下列何者最適當？
A. 繼續觀察，4 至 6 小時後再追蹤動脈血液氣體分析
B. 立即插管，並予呼吸器協助呼吸
C. 給予氧氣罩及 10 公升/分的氧氣
D. 給予間歇性正壓呼吸器及百分之百的氧氣

正確答案：A. 繼續觀察，4 至 6 小時後再追蹤動脈血液氣體分析